Clinical trial exclusion criterion:
With acute myocardial infarction with ST segment elevation in the first 12 hours from the onset of symptoms.

Entity relations:
- Has_index("in the first 12 hours from the onset of symptoms", "the onset of symptoms")
- AND("acute myocardial infarction", "ST segment elevation")
- Has_temporal("acute myocardial infarction", "in the first 12 hours from the onset of symptoms")